What is included in the Mentzer index?

Mentzer index (MCV/RBC) is mean corpuscular volume (MCV) and red blood cell count (RBC) ratio. It is used for differentiation of thalassemia and iron deficiency anemia.